Clinical trial inclusion criterion:
Early pregnancy body weight is 50-90 Kg

Annotated entities:
- Temporal: "Early pregnancy"
- Measurement: "body weight"
- Value: "50-90 Kg"